Clinical trial inclusion criterion:
Parkinson disease diagnosed by United Kingdom Parkinson's disease Society Brain Bank Criteria

Entity relations:
- AND("Parkinson disease", "United Kingdom Parkinson's disease Society Brain Bank Criteria")